Clinical trial inclusion criterion:
empyema.

Annotated entities:
- Condition: "empyema"